Prior uterine scar

The above is a clinical trial exclusion criterion. Annotated with entity spans:
Prior [Condition: uterine scar]